Clinical trial exclusion criterion:
History of BCG sepsis

Entity relations:
- AND("sepsis", "BCG")
- Has_temporal("sepsis", "History")